Clinical trial exclusion criterion:
micturition problems,

Annotated entities:
- Condition: "micturition"